Established diagnosis of UC and moderate-to-severe disease activity, defined as a Mayo score of 6-12, with an endoscopic subscore =2.

The above is a clinical trial inclusion criterion. Annotated with entity spans:
Established diagnosis of [Condition: UC] and [Qualifier: moderate-to-severe] disease activity, defined as a [Measurement: Mayo score] of [Value: 6-12], with an [Measurement: endoscopic subscore] [Value: =2].